Clinical trial exclusion criterion:
Subject who is illiterate or unable to understand the Informed Consent Form, questionnaires or subject diary

Entity relations:
- OR("understand the Informed Consent Form", "understand the questionnaires", "understand the subject diary")